History of previous myocardial infarction (MI)

The above is a clinical trial inclusion criterion. Annotated with entity spans:
History of previous [Condition: myocardial infarction] ([Condition: MI])